Patients with a seizure history

The above is a clinical trial exclusion criterion. Annotated with entity spans:
Patients with a [Condition: seizure] [Temporal: history]